Clinical trial exclusion criterion:
Severe renal impairment creatinine clearance (CrCl), i.e. < 30 mL/min.

Annotated entities:
- Condition: "renal impairment"
- Qualifier: "Severe"
- Measurement: "creatinine clearance"
- Measurement: "CrCl"
- Value: "< 30 mL/min"